Clinical trial inclusion criterion:
Age greater than or equal to 18 years old

Annotated entities:
- Person: "Age"
- Value: "greater than or equal to 18 years old"